Clinical trial inclusion criterion:
Informed consent about histological examination (core cut biopsy (CCB), vacuum-assisted biopsy (VAB), fine needle aspiration (FNA) or surgery) has already been given in the course of clinical routine

Annotated entities:
- Procedure: "histological examination"
- Procedure: "core cut biopsy (CCB)"
- Procedure: "vacuum-assisted biopsy (VAB)"
- Procedure: "fine needle aspiration (FNA)"
- Procedure: "surgery"
- Post-eligibility: "Informed consent"